下列何者受損時，會影響前移（protract）肩胛骨（scapula）的功能？
A. 胸大肌（pectoralis major）
B. 胸小肌（pectoralis minor）
C. 鎖骨下肌（subclavius）
D. 前鋸肌（serratus anterior）

正確答案：D. 前鋸肌（serratus anterior）